Clinical trial inclusion criterion:
Singleton gestation .scheduled for ECV desiring CSE.

Entity relations:
- Has_mood("CSE", "desiring")
- AND("ECV", "CSE")
- Has_mood("ECV", "scheduled for")